Clinical trial inclusion criterion:
Total weekly IgPro20 dose of = 50 mL (= 10 g).

Entity relations:
- Subsumes("= 50 mL", "= 10 g")
- Has_qualifier("IgPro20", "weekly")
- Has_multiplier("IgPro20", "= 50 mL")